Clinical trial inclusion criterion:
croup children between 6 month and 5 years old

Entity relations:
- Has_value("old", "between 6 month and 5 years")